關於譫妄（delirium），下列敘述何者錯誤？
A. 抗精神病長效針劑是治療譫妄之首選藥物之一
B. 年齡大於70歲的患者為譫妄的高危險群
C. 譫妄是一個臨床整體預後不佳的指標
D. 譫妄的核心症狀包含了意識狀態的障礙及認知、知覺的改變

正確答案：A. 抗精神病長效針劑是治療譫妄之首選藥物之一